En el Ciclo de la Urea, ¿dónde se requiere la hidrólisis de ATP?
1. En la formación de Citrulina.
2. En la formación de Ornitina.
3. En la formación de Urea.
4. En la formación de Carbamoil-Fosfato.
5. 3 y 4 son correctas.

Respuesta correcta: 4. En la formación de Carbamoil-Fosfato.